11. Stroke or transient ischemic attack within the prior 3 months.

The above is a clinical trial exclusion criterion. Annotated with entity spans:
11. [Condition: Stroke] or [Condition: transient ischemic attack] [Temporal: within the prior 3 months].